Clinical trial exclusion criterion:
1. Comorbidity with other severe or chronic eye conditions that in the judgment of the investigator will interfere with study assessments, such as corneal opacities and scars, dystrophies, epithelial scarring, infections, blood clots, etc.

Entity relations:
- Has_qualifier("eye conditions", "will interfere with study assessments")
- AND("eye conditions", "corneal opacities")
- OR("corneal opacities", "dystrophies", "epithelial scarring", "infections", "blood clots", "corneal scars")